3. Residence in AFRH-Washington or the Veterans Home of California-Yountville

The above is a clinical trial inclusion criterion. Annotated with entity spans:
3. [Observation: Residence] in [Visit: AFRH-Washington] or the [Visit: Veterans Home of California-Yountville]